List clinical trials for prevention of sarcopenia

Several clinical trials with androgen replacement therapy. 
Study was to evaluate the effect of omega-3 fatty acid supplementation on the rate of muscle protein synthesis. This trial was registered at clinical trials.gov as NCT00794079